Diabetes or immediate family history of diabetes

The above is a clinical trial exclusion criterion. Annotated with entity spans:
[Condition: Diabetes] or [Observation: immediate family history] of [Condition: diabetes]